一位 65 歲男性，因聲音沙啞被發現有右側聲帶麻痺。進一步胸部 X 光攝影發現右上肺部有腫瘤，經胸腔科醫師證實為肺癌。導致這位病人聲帶麻痺最可能的原因為下列何者？
A. 肺癌經氣管侵犯聲帶
B. 肺癌喉部轉移
C. 肺癌侵犯縱膈腔上方
D. 肺癌腦幹轉移

正確答案：C. 肺癌侵犯縱膈腔上方